Clinical trial exclusion criteria:
age under 18y or over 85y
diabetes type 1 with complications
no co-operation or inadequate finnish language skills
persistent pain for other reason
severe hepatic insufficiency or paracetamol (acetaminophen) is contraindicated for other reason
any type of steroid in regular use
oxycodone contraindicated
medications changing notably paracetamol (acetaminophen) and/or ropivacaine metabolism in regular use

Annotated entities:
- Person: "age"
- Value: "under 18y or over 85y"
- Condition: "diabetes type 1"
- Condition: "complications"
- Observation: "co-operation"
- Negation: "no"
- Observation: "inadequate finnish language skills"
- Condition: "persistent pain"
- Qualifier: "other reason"
- Qualifier: "severe"
- Condition: "hepatic insufficiency"
- Drug: "paracetamol"
- Drug: "acetaminophen"
- Condition: "contraindicated"
- Drug: "steroid"
- Multiplier: "regular use"
- Drug: "oxycodone"
- Condition: "contraindicated"
- Drug: "paracetamol"
- Drug: "acetaminophen"
- Drug: "ropivacaine"
- Multiplier: "regular use"